18. Concomitant administration of oral contraceptives (may be included with 7-day washout period)

The above is a clinical trial exclusion criterion. Annotated with entity spans:
[Parsing_Error: 18.] [Temporal: Concomitant] administration of [Drug: oral contraceptives] [Not_a_criteria: (may be included with 7-day washout period)]